Están implicadas en la acción lítica de los linfocitos T citotóxicos:
1. Granzimas.
2. Opsoninas.
3. Histaminas.
4. Integrinas.
5. Catepsinas.

Respuesta correcta: 1. Granzimas.